AST or ALT >350 within 6 months prior to enrollment

The above is a clinical trial exclusion criterion. Annotated with entity spans:
[Measurement: AST] or [Measurement: ALT] [Value: >350] [Temporal: within 6 months prior to enrollment]